Any history of brain metastases or any other active central nervous system (CNS) disease

The above is a clinical trial exclusion criterion. Annotated with entity spans:
Any [Temporal: history of] [Condition: brain metastases] or [Condition: any other] [Temporal: active] central nervous system (CNS) disease